Patient has necessary mental capacity to participate and is able to comply with study protocol requirements;

The above is a clinical trial inclusion criterion. Annotated with entity spans:
[Post-eligibility: Patient has necessary mental capacity to participate and is able to comply with study protocol requirements];